Allergic reaction upon erythropoietin

The above is a clinical trial exclusion criterion. Annotated with entity spans:
[Condition: Allergic] reaction upon [Drug: erythropoietin]